List available biomedical question answering systems.

askHERMES, EAGLi, HONQA and INDOC.